下列何者不屬於旋轉肌袖（rotator cuff）的組成肌肉？
A. 肱二頭肌（biceps brachii）
B. 脊上肌（supraspinatus）
C. 脊下肌（infraspinatus）
D. 肩胛骨下肌（subscapularis）

正確答案：A. 肱二頭肌（biceps brachii）